雙胞胎容易發生輸血症候群（twin-twin-transfusion syndrome），下列那一項是雙胞胎輸血症候群捐血者（donor）的特徵？
A. 全身水腫
B. 不同性別
C. 羊水過多
D. 體重過輕

正確答案：D. 體重過輕